Clinical trial inclusion criterion:
Adult women at least 18 years of age

Entity relations:
- Has_value("age", "at least 18 years")